Clinical trial exclusion criterion:
Severe renal failure with estimated glomerular filtration rate <30 ml/min

Entity relations:
- Has_value("estimated glomerular filtration rate", "<30 ml/min")
- Has_qualifier("renal failure", "Severe")
- AND("renal failure", "estimated glomerular filtration rate")